Patients already taking warfarin, cilostazol or any other type of anti-platelet agents except aspirin and clopidogrel

The above is a clinical trial exclusion criterion. Annotated with entity spans:
Patients already taking [Drug: warfarin], [Drug: cilostazol] or any other type of [Drug: anti-platelet agents] [Negation: except] [Drug: aspirin] and [Drug: clopidogrel]